Clinical trial exclusion criterion:
Severe cardiovascular, hepatic, renal disease or neurological impairment.

Entity relations:
- OR("hepatic disease", "disease cardiovascular", "neurological impairment", "renal disease")